Clinical trial inclusion criterion:
Elevated triglycerides (=150 mg/dl), or on medication for treating the condition

Annotated entities:
- Measurement: "triglycerides"
- Value: "Elevated"
- Value: "=150 mg/dl"
- Drug: "medication for treating"
- Qualifier: "triglycerides"